El shock séptico que puede presentarse en el curso de la infecciones sistémicas por bacterias Gram-negativas se debe a:
1. Lipopolisacárido.
2. Péptido-glucano.
3. Ácidos teicoicos.
4. Flagelina.
5. Antígeno K.

Respuesta correcta: 1. Lipopolisacárido.